Clinical trial exclusion criterion:
Rheumatic conditions (Rheumatoid arthritis, lupus, and any other autoimmune disease the -PI deems them to be ineligible for)

Annotated entities:
- Condition: "Rheumatic conditions"
- Condition: "Rheumatoid arthritis"
- Condition: "lupus"
- Condition: "autoimmune disease"